Clinical trial exclusion criterion:
follow-up is inadequate

Annotated entities:
- Observation: "follow-up is inadequate"